Clinical trial exclusion criterion:
Hypersensitivity to the active substance or to any of the excipients or to E. coli derived proteins

Annotated entities:
- Condition: "Hypersensitivity"
- Non-query-able: "to the active substance or to any of the excipients or to E. coli derived proteins"